Clinical trial exclusion criterion:
Hemoglobin < 9 g/dL.

Entity relations:
- Has_value("Hemoglobin", "< 9 g/dL")